Clinical trial exclusion criteria:
Other tumor type than adenocarcinoma
Central nervous system (CNS) metastases or prior radiation for CNS metastases
Gastric outlet obstruction or intestinal obstruction
Evidence of gastrointestinal bleeding
The patient has bony lesions as the sole evaluable disease.
Past or concurrent history of neoplasm other than stomach cancer, except for curatively treated non-melanoma skin cancer or in situ carcinoma of the cervix uteri
Pregnant or lactating women, women of childbearing potential not employing adequate contraception
Other serious illness or medical conditions
Unstable cardiac disease despite treatment, myocardial infarction within 6 months prior to study entry
History of significant neurologic or psychiatric disorders including dementia or seizures
Active uncontrolled infection
Other serious underlying medical conditions which could impair the ability of the patient to participate in the study
Concomitant administration of any other experimental drug under investigation, or concomitant chemotherapy, hormonal therapy, or immunotherapy
concomitant drug medication; The following drugs cause drug interaction with S-1.
i. Warfarin, phenprocoumon: increase bleeding tendency ii. Increase blood concentration of phenytoin iii. sorivudine: inhibit DPD -> increase toxicity according to fluoropyrimidine iv. allopurinol : decrease activity of S-1

Annotated entities:
- Condition: "adenocarcinoma"
- Condition: "tumor"
- Negation: "Other"
- Condition: "Central nervous system (CNS) metastases"
- Procedure: "radiation"
- Condition: "CNS metastases"
- Condition: "Gastric outlet obstruction"
- Condition: "intestinal obstruction"
- Condition: "gastrointestinal bleeding"
- Observation: "Evidence of"
- Condition: "bony lesions"
- Value: "the sole"
- Qualifier: "evaluable disease"
- Temporal: "history of"
- Condition: "neoplasm"
- Condition: "stomach cancer"
- Condition: "non-melanoma skin cancer"
- Condition: "in situ carcinoma of the cervix uteri"
- Procedure: "treated"
- Qualifier: "curatively"
- Negation: "other than"
- Negation: "except for"
- Condition: "Pregnant"
- Condition: "lactating"
- Person: "women"
- Condition: "childbearing potential"
- Person: "women"
- Procedure: "contraception"
- Negation: "not employing"
- Condition: "serious illness"
- Condition: "medical conditions"
- Condition: "Unstable cardiac disease"
- Procedure: "treatment"
- Condition: "myocardial infarction"
- Temporal: "within 6 months prior to study entry"
- Condition: "neurologic disorders"
- Condition: "psychiatric disorders"
- Condition: "dementia"
- Condition: "seizures"
- Temporal: "History"
- Condition: "infection"
- Qualifier: "uncontrolled"
- Temporal: "Active"
- Condition: "serious medical conditions"
- Observation: "ability of the patient to participate"
- Drug: "experimental drug"
- Temporal: "Concomitant"
- Procedure: "chemotherapy"
- Procedure: "hormonal therapy"
- Procedure: "immunotherapy"
- Temporal: "concomitant"
- Drug: "medication"
- Drug: "drug"
- Temporal: "concomitant"
- Non-representable: "The following drugs cause drug interaction with S-1."
- Drug: "Warfarin"
- Drug: "phenprocoumon"
- Measurement: "bleeding tendency"
- Measurement: "blood concentration of phenytoin"
- Value: "Increase"
- Drug: "sorivudine"
- Drug: "allopurinol"
- Value: "increase"
- Drug: "fluoropyrimidine"
- Non-representable: "increase bleeding tendency"
- Non-representable: "Increase blood concentration of phenytoin"